下列那些藥物可能會加重逆流性食道炎（reflux esophagitis）？①降血脂藥（HMG-CoA reductase inhibitor） ②高血壓用藥（calcium channel blocker） ③氣喘用藥 （theophylline） ④抗過敏藥物（antihistamine）
A. ①②③
B. 僅②③
C. ③④
D. ①②④

正確答案：B. 僅②③